Receiving antibiotic and/or probiotic, 8 weeks before the study

The above is a clinical trial exclusion criterion. Annotated with entity spans:
Receiving [Drug: antibiotic] and/or [Drug: probiotic], [Temporal: 8 weeks before the study]